Stable blood pressure regimen, stable lipid regimen, stable diabetes regimen and risk factor control for 6 weeks.

The above is a clinical trial inclusion criterion. Annotated with entity spans:
[Qualifier: Stable] [Procedure: blood pressure regimen], [Qualifier: stable] [Procedure: lipid regimen], [Qualifier: stable] [Procedure: diabetes regimen] and [Procedure: risk factor control] [Multiplier: for 6 weeks].